Clinical trial exclusion criterion:
Mini-mental State Examination (MMSE) [18] score = 23.

Annotated entities:
- Measurement: "Mini-mental State Examination (MMSE)"
- Value: "= 23"